Are assessed by the clinic staff as being at low risk for HIV infection

The above is a clinical trial inclusion criterion. Annotated with entity spans:
Are assessed by the clinic staff as being at [Condition: low risk] for [Condition: HIV infection]